Clinical trial inclusion criterion:
Patient aged 18 years or older.

Annotated entities:
- Value: "18 years or older"
- Person: "aged"